Simultaneous participation in another interventional clinical trial (drugs or medical devices studies)

The above is a clinical trial exclusion criterion. Annotated with entity spans:
[Non-query-able: Simultaneous participation in another interventional clinical trial (drugs or medical devices studies)]